Vulnerable patients (Patient referred to in Articles L. 1121-5 to L. 1121-8 and L. 1122-1-2 of the French Public Health Code)

The above is a clinical trial exclusion criterion. Annotated with entity spans:
[Observation: Vulnerable patients] (Patient referred to in [Qualifier: Articles L. 1121-5 to L. 1121-8 and L. 1122-1-2 of the French Public Health Code])